Clinical trial inclusion criterion:
Term singleton infants (>37 weeks gestational age)

Entity relations:
- Has_value("gestational age", ">37 weeks")
- AND("Term infants", "gestational age")
- OR("Term infants", "singleton infants")